Have symptoms of vaginal odor and or/discharge

The above is a clinical trial inclusion criterion. Annotated with entity spans:
Have [Mood: symptoms of] [Condition: vaginal odor] and or/discharge